三星期大的足月產女嬰因這星期開始反覆噴射性嘔吐至急診室求診。出生體重 2400 gm，目前體重降至 2100 gm，抽血化驗 arterial blood gas : pH = 7.58, PaCO2 = 56 mmHg, HCO3- = 51.8 mmol/L, BE = 25.6 mmol/L, [Na+] = 114 mmol/L, [K+] = 1.7 mmol/L, [Cl-] = 68 mmol/L，血壓為 68/40 mmHg，BUN/Creatinine =  5 mg/dL；下列病因何者最不可能？
A. 腸道不通造成嘔吐
B. 脫水造成急性腎衰竭
C. 幽門狹窄（pyloric stenosis）併 pseudo-Bartter's syndrome
D. 先天腎上腺增生（congenital adrenal hyperplasia）

正確答案：D. 先天腎上腺增生（congenital adrenal hyperplasia）